Clinical trial exclusion criterion:
2. Subject underwent cardiac pacemaker treatment;

Entity relations:
- AND("cardiac pacemaker treatment", "cardiac pacemaker")